Normal hearing

The above is a clinical trial inclusion criterion. Annotated with entity spans:
[Condition: Normal hearing]